Clinical trial exclusion criteria:
dysphagia
severe gastroparesis requiring endoscopic placement of capsule
small bowel obstruction
pregnancy

Annotated entities:
- Condition: "dysphagia"
- Condition: "gastroparesis"
- Qualifier: "severe"
- Procedure: "endoscopic placement"
- Device: "capsule"
- Mood: "requiring"
- Condition: "small bowel obstruction"
- Condition: "pregnancy"